Clinical trial inclusion criterion:
Nonsurgical neonates and babies up to age 6 months with INR 1.5 or more who are deemed clinically to need plasma infusion.

Annotated entities:
- Person: "neonates"
- Condition: "Nonsurgical"
- Person: "babies"
- Value: "up to age 6 months"
- Person: "age"
- Measurement: "INR"
- Value: "1.5 or more"
- Procedure: "plasma infusion"
- Condition: "need"